Clinical trial inclusion criterion:
M. perstans mg-positive status Good general health without any clinical condition requiring long-term medication.

Annotated entities:
- Measurement: "M. perstans mg"
- Value: "positive"
- Condition: "Good general health"
- Condition: "clinical condition requiring long-term medication"
- Drug: "long-term medication"
- Qualifier: "requiring long-term medication"
- Undefined_semantics: "clinical condition requiring long-term medication"
- Negation: "without"
- Parsing_Error: "M. perstans mg-positive status Good general health without any clinical condition requiring long-term medication."